Clinical trial exclusion criterion:
Active bacterial endocarditis within 6 months (180 days) of procedure.

Annotated entities:
- Condition: "bacterial endocarditis"
- Temporal: "Active"
- Temporal: "within 6 months (180 days) of procedure"
- Reference_point: "of procedure"